1個月大的新生兒，睡眠時正常心跳的範圍為：
A. 100～140次/分
B. 160～180次/分
C. 80～100次/分
D. 180～220次/分

正確答案：A. 100～140次/分